Clinical trial inclusion criterion:
able to consent

Annotated entities:
- Informed_consent: "able to consent"